Blood glucose < 50 mg/dL (2.7mmol/L);

The above is a clinical trial exclusion criterion. Annotated with entity spans:
[Measurement: Blood glucose] [Value: < 50 mg/dL] ([Value: 2.7mmol/L]);